Clinical trial inclusion criterion:
Has Barcelona Clinic Liver Cancer (BCLC) Stage C disease or BCLC Stage B disease not amenable to locoregional therapy or refractory to locoregional therapy and not amenable to a curative treatment approach

Annotated entities:
- Measurement: "Barcelona Clinic Liver Cancer (BCLC)"
- Value: "Stage C"
- Condition: "disease"
- Context_Error: "disease"
- Measurement: "BCLC"
- Value: "Stage B"
- Qualifier: "amenable to locoregional therapy"
- Qualifier: "refractory to locoregional therapy"
- Qualifier: "amenable to a curative treatment approach"
- Negation: "not"
- Negation: "not"
- Condition: "disease"
- Context_Error: "disease"